82 歲男性，被家人送入急診，主訴為 3 天來持續腹瀉。病人為一中風患者，以鼻胃管灌食，長期臥床，有便秘問題，並規則服用軟便藥，最近無服用抗生素。外傭發現這 3 天來病人胃口不佳且腹脹，尿布上有大量黏液狀物體，無成型糞便。理學檢查發現體溫為 36.6℃，腸音加快，整個腹部膨脹，有些微壓痛感（tenderness），肛門觸診在直腸處有摸到一塊稍硬的糞便。依此病人臨床表現，你認為何種疾病最有可能？
A. 糞便阻塞（stool impaction）
B. 軟便劑引起的腹瀉
C. 急性腸胃炎（acute gastroenteritis）
D. 假膜性腸炎（pseudomembranous colitis）

正確答案：A. 糞便阻塞（stool impaction）